Prior stroke with functional impairment or other severe, uncontrolled medical problems that may impair ability to participate in the study exams, based on medical history and review of medical records

The above is a clinical trial exclusion criterion. Annotated with entity spans:
Prior [Condition: stroke] with [Condition: functional impairment] or [Non-query-able: other severe, uncontrolled medical problems that may impair ability to participate in the study exams, based on medical history and review of medical records]